關於Zollinger-Ellison syndrome下列何者敘述正確？
A. 成因為beta cell endocrine tumor不正常分泌gastrin，導致胃酸大量分泌，造成難治性潰瘍
B. 在peptic ulcer disease的病患中可占0.1～1%，此症狀發生gastrinoma，它與multiple endocrine neoplasia
C. 在clinical presentation上以peptic ulcer及erosive esophagitis為主，下消化道腹瀉的症狀相當罕見
D. Zollinger-Ellison syndrome之gastrinoma罕有惡性的可能性，腫瘤遠處轉移的狀況相當少見

正確答案：B. 在peptic ulcer disease的病患中可占0.1～1%，此症狀發生gastrinoma，它與multiple endocrine neoplasia